other medical or psychiatric coexisting disorders that could increase the surgical risk or interfere with completion of the trial

The above is a clinical trial exclusion criterion. Annotated with entity spans:
[Post-eligibility: other medical or psychiatric coexisting disorders that could increase the surgical risk or interfere with completion of the trial]